Grade 0 finger/thumb extension at 6 months

The above is a clinical trial inclusion criterion. Annotated with entity spans:
[Value: Grade 0] [Qualifier: finger]/[Qualifier: thumb] [Measurement: extension] [Temporal: at 6 months]